Clinical trial exclusion criterion:
chronic pancreatitis or pancreatic cancer

Entity relations:
- OR("chronic pancreatitis", "pancreatic cancer")